某 3 歲男童由育嬰中心回家後突然開始發高燒、喉嚨痛、咳嗽、肌肉酸痛及腹部疼痛、嘔吐等症狀，其母親即給予服用阿斯匹靈退燒，此男童服藥後不但病情未減輕反而引發肝功能異常與腦部 病變（encephalopathy），最後此男童不幸死亡，此男童可能為何病原所感染？
A. 流行性感冒噬血桿菌（Haemophilus influenzae）
B. 肺炎雙球菌（Streptococcus pneumoniae）
C. 流行性感冒病毒（influenza virus）
D. 麻疹病毒（measles virus）

正確答案：C. 流行性感冒病毒（influenza virus）